Clinical trial inclusion criterion:
15. Females of childbearing potential and sexually mature males must agree to use a medically accepted method of contraception throughout the study.

Annotated entities:
- Pregnancy_considerations: "Females of childbearing potential and sexually mature males must agree to use a medically accepted method of contraception throughout the study."